Mental or nervous system disorders.

The above is a clinical trial inclusion criterion. Annotated with entity spans:
[Condition: Mental] or [Condition: nervous system disorders].